Clinical trial inclusion criterion:
Women stimulated with Syntocinon® infusion for induction of labour (with or without cervical priming by prostaglandin)

Annotated entities:
- Person: "Women"
- Drug: "Syntocinon®"
- Procedure: "Syntocinon® infusion"
- Procedure: "induction of labour"
- Procedure: "cervical priming"
- Drug: "prostaglandin"